A consent form signed by the patient or patient's representative

The above is a clinical trial inclusion criterion. Annotated with entity spans:
[Post-eligibility: A consent form signed by the patient or patient's representative]